Subjects with any condition that as judged by the Investigator would place the subject at increased risk of harm if he/she participated in the study.

The above is a clinical trial exclusion criterion. Annotated with entity spans:
[Non-query-able: Subjects with any condition that as judged by the Investigator would place the subject at increased risk of harm if he/she participated in the study].